Profound chorioretinal atrophy in central macular area on ophthalmoscopy and OCT;

The above is a clinical trial exclusion criterion. Annotated with entity spans:
[Qualifier: Profound] [Condition: chorioretinal atrophy] in [Qualifier: central macular area] on [Procedure: ophthalmoscopy] and [Procedure: OCT];